視網膜中心動脈阻塞時，視網膜會出現：
A. 視網膜新生血管（neovascuarization）
B. 視網膜出血（retinal hemorrhage）
C. 視網膜滲出物（retinal exudation）
D. 黃斑部呈櫻桃紅色（cherry-red spot）

正確答案：D. 黃斑部呈櫻桃紅色（cherry-red spot）